La aspirina es un inhibidor de la síntesis de:
1. Esteroles.
2. Prostaglandinas.
3. Fosfoacilglicéridos.
4. Ácido araquidónico.
5. Glicerofosfolípidos.

Respuesta correcta: 2. Prostaglandinas.